List the common retinal diseases associated with circRNAs.

Circular RNAs (circRNAs) in whole blood could be served as novel non-invasive biomarkers for retinal degeneration, diabetic retinopathy, proliferative diabetic retinopathy (PDR) and Retinopathy of prematurity (ROP)